Clinical trial exclusion criterion:
Diabetes Mellitus (insulin therapy)

Entity relations:
- AND("Diabetes Mellitus", "insulin")